Clinical trial inclusion criterion:
Absence of hemodynamic collapse, or decompensation, at presentation; Hemodynamic collapse or decompensation

Annotated entities:
- Condition: "hemodynamic collapse"
- Negation: "Absence"
- Condition: "hemodynamic decompensation"